periprocedural complications requiring continuation of heparin or administration of protamine sulfate

The above is a clinical trial exclusion criterion. Annotated with entity spans:
[Condition: periprocedural complications] [Mood: requiring] continuation of [Drug: heparin] or administration of [Drug: protamine sulfate]